Lactation

The above is a clinical trial exclusion criterion. Annotated with entity spans:
[Condition: Lactation]